Clinical trial inclusion criteria:
Ulcerative colitis patients with moderate to severe activity who achieved a clinical remission by the first course of corticosteroids
Newly diagnosed or without steroid use during last 1 year
Endoscopic Mayo subscore >0

Annotated entities:
- Condition: "Ulcerative colitis"
- Qualifier: "moderate to severe"
- Condition: "clinical remission"
- Temporal: "by the first course of corticosteroids"
- Reference_point: "first course of corticosteroids"
- Multiplier: "first course"
- Drug: "corticosteroids"
- Negation: "without"
- Drug: "steroid"
- Temporal: "during last 1 year"
- Measurement: "Endoscopic Mayo subscore"
- Value: ">0"